Clinical trial exclusion criterion:
Patients with liver disease (documented liver function test abnormality)

Annotated entities:
- Condition: "liver disease"
- Measurement: "liver function test"
- Value: "abnormality"